Clinical trial inclusion criterion:
Typical AMD and PCV patients

Entity relations:
- OR("AMD", "PCV patients")